taking prescribed gabapentin at the time of admission for CD

The above is a clinical trial exclusion criterion. Annotated with entity spans:
taking [Qualifier: prescribed] [Drug: gabapentin] [Temporal: at the time of admission for CD]